Clinical trial exclusion criterion:
Post infection of knee

Entity relations:
- Has_temporal("infection of knee", "Post")